¿Cuál es el fundamento químico de la inhibición reversible de la acetilcolinesterasa por el alcaloide fisostigmina y compuestos relacionados?:
1. Inhibición alostérica de la enzima.
2. Unión covalente a un cofactor esencial para la reacción.
3. Coordinación de un catión Mg2+ en el centro activo de la enzima.
4. Analogía con el estado de transición de la reacción catalizada por la enzima.
5. Formación de un carbamato (carbamoilación) del resto de serina en el centro activo de la enzima.

Respuesta correcta: 5. Formación de un carbamato (carbamoilación) del resto de serina en el centro activo de la enzima.